Inability to provide written informed consent according to the Yale Human Investigation Committee (HIC) guidelines in English.

The above is a clinical trial exclusion criterion. Annotated with entity spans:
[Negation: Inability to provide] [Observation: written informed consent] according to the [Qualifier: Yale Human Investigation Committee (HIC) guidelines] [Qualifier: in English].